下列關於交感性眼炎（sympathetic ophthalmitis）的敘述，何者錯誤？
A. 是一種兩側性非肉芽腫型（non-granulomatous）葡萄膜炎
B. 可能與眼受傷或眼球接受手術有關
C. 臨床表現與原田氏病（Harada disease）相類似
D. 不治療可能導致眼盲

正確答案：A. 是一種兩側性非肉芽腫型（non-granulomatous）葡萄膜炎